Clinical trial inclusion criterion:
ability to use verbal or pictorial pain assessment tools and techniques

Entity relations:
- AND("ability", "verbal pain assessment tools and techniques")
- OR("verbal pain assessment tools and techniques", "pictorial pain assessment tools and techniques")